下列關於內在因子（intrinsic factor）之敘述，何者正確？
A. 是一種醣蛋白分子
B. 由胃主細胞（chief cell）分泌
C. 促進維生素B12在空腸（jejunum）的吸收
D. 影響白血球的製造

正確答案：A. 是一種醣蛋白分子